Clinical trial exclusion criterion:
Planned kidney transplant in the next 4 months

Annotated entities:
- Condition: "kidney transplant"
- Qualifier: "Planned"
- Temporal: "in the next 4 months"